Clinical trial exclusion criteria:
Conversion to laparotomy
Emergent re intervention
Immunosuppression
Umbilical hernia

Annotated entities:
- Observation: "Conversion to"
- Procedure: "laparotomy"
- Procedure: "re intervention"
- Qualifier: "Emergent"
- Condition: "Immunosuppression"
- Condition: "Umbilical hernia"